肺癌病人不適合手術的情況，下列何者錯誤？
A. 喉返神經麻痺
B. 發生上腔靜脈症候群（superior vena cava syndrome）
C. 肺癌局部侵犯橫膈膜
D. 有肝臟轉移

正確答案：C. 肺癌局部侵犯橫膈膜